Clinical trial inclusion criterion:
Systemic sclerosis patients:

Annotated entities:
- Not_a_criteria: "Systemic sclerosis patients:"